Clinical trial exclusion criterion:
History of seizures within last 10 years

Annotated entities:
- Condition: "seizures"
- Temporal: "within last 10 years"